16 歲的彥君罹患惡性淋巴瘤，接受二次化學療法，效果不彰且併發過敗血症，滿頭秀髮所剩無幾。最近檢查顯示癌症復發需再次接受化學療法，彥君向她父母嚴重表示不願再接受任何治療，而父母堅持繼續治療。彥君的主治醫師於下列那一種作法最恰當？
A. 家長都是為孩子好，應照彥君父母的意見做
B. 依尊重自主原則同意彥君的請求，不再給予任何治療
C. 提供諮詢，協助父母與彥君的看法達到一致後再進行後續處理
D. 訴請法院裁決

正確答案：C. 提供諮詢，協助父母與彥君的看法達到一致後再進行後續處理